Clinical trial inclusion criterion:
Patients with chronic heart failure present for at least 12 months

Entity relations:
- Has_temporal("chronic heart failure", "for at least 12 months")